High-grade block in the absence of a functioning pacemaker.

The above is a clinical trial exclusion criterion. Annotated with entity spans:
[Condition: High-grade block] [Negation: in the absence of] a [Qualifier: functioning] [Device: pacemaker].